下列何者是目前最常用來治療甲癬（onychomycosis; tinea unguium）之口服藥物？
A. 特比萘芬（Terbinafine）
B. 制黴菌素（Nystatin）
C. 兩性黴素B
D. mphotericin B）

正確答案：A. 特比萘芬（Terbinafine）